Clinical trial exclusion criterion:
Surgery with major complication, or need blood transfusion.

Annotated entities:
- Condition: "major complication"
- Procedure: "Surgery"
- Mood: "need"
- Condition: "blood transfusion"